Clinical trial inclusion criterion:
Able to give fully informed consent in writing

Annotated entities:
- Post-eligibility: "Able to give fully informed consent in writing"